Clinical trial exclusion criterion:
Diagnosed or suspected local gynecologic lesion (polyp, adenomyosis, myoma, malignancy or cervical pathology).

Entity relations:
- Has_mood("local gynecologic lesion", "Diagnosed")
- Subsumes("local gynecologic lesion", "polyp")
- OR("Diagnosed", "suspected")
- OR("polyp", "malignancy", "myoma", "adenomyosis", "cervical pathology")